Clinical trial exclusion criterion:
A heart rate less than 50 beats/minute or grade 2 or 3 AV heart block

Entity relations:
- Has_qualifier("AV heart block", "grade 2")
- Has_value("heart rate", "less than 50 beats/minute")
- OR("grade 2", "grade 3")
- OR("heart rate", "AV heart block")